僵直（catatonia）可見於多種精神疾病，以下何者非catatonia之症狀？
A. 不語（mutism）
B. 蠟曲現象（waxy flexibility）
C. 仿說（echolalia）
D. 靜坐不能（akathisia）

正確答案：D. 靜坐不能（akathisia）